El óxido de osmio (VIII), OsO4:
1. Es un compuesto en un estado de oxidación muy común entre los metales de transición.
2. Es el único compuesto binario de osmio con oxígeno.
3. Tiene la estructura del trióxido de renio.
4. Es inerte frente a los hidróxidos alcalinos.
5. Se utiliza como oxidante en química orgánica.

Respuesta correcta: 5. Se utiliza como oxidante en química orgánica.